Clinical trial exclusion criterion:
Active infection requiring systemic treatment or any uncontrolled infection <=14 days prior to first dose of study treatment (with the exception of uncomplicated urinary tract infection or upper respiratory tract infection).

Entity relations:
- Has_temporal("infection", "Active")
- Has_index("<=14 days prior to first dose of study treatment", "first dose of study treatment")
- AND("infection", "systemic treatment")
- Has_qualifier("uncontrolled infection", "any")
- Has_temporal("infection", "<=14 days prior to first dose of study treatment")
- Has_qualifier("urinary tract infection", "uncomplicated")
- Has_qualifier("upper respiratory tract infection", "uncomplicated")
- Has_negation("urinary tract infection", "with the exception of")
- AND("infection", "urinary tract infection")
- OR("infection", "uncontrolled infection")
- OR("urinary tract infection", "upper respiratory tract infection")